Clinical trial exclusion criterion:
remaining vestibular function

Annotated entities:
- Condition: "remaining vestibular function"